Concomitant participation in other trial

The above is a clinical trial exclusion criterion. Annotated with entity spans:
[Competing_trial: Concomitant participation in other trial]